What is marked by DNaseI hypersensitive sites?

DNAaseI hypersensitive sites consist of covalent domains that are hypersensitive to DNA polymerase I and are generally found in genomic regulatory regions where transcription starts and stops at these regions.